Clinical trial exclusion criterion:
Apparent sensitivity to any of the study peptides as determined by the skin test

Entity relations:
- AND("sensitivity", "study peptides")
- AND("skin test", "sensitivity")